Clinical trial exclusion criteria:
Children (<18 years old).
Women who are known to be pregnant.
Any patient who has been previously randomized in the EvK Trial.
Patients who require endotracheal intubation without sedative medication. For example, patients in full cardiac arrest.
Patients with a known allergy to ketamine or etomidate.
Any individual wearing a MedAlert bracelet indicating that he/she has formally opted out of the EvK Trial.

Annotated entities:
- Person: "Children"
- Value: "<18 years"
- Person: "old"
- Person: "Women"
- Condition: "pregnant"
- Procedure: "randomized"
- Temporal: "previously"
- Procedure: "endotracheal intubation"
- Observation: "require"
- Drug: "sedative medication"
- Negation: "without"
- Condition: "full cardiac arrest"
- Condition: "allergy"
- Drug: "ketamine"
- Drug: "etomidate"
- Condition: "Any individual wearing a MedAlert bracelet indicating that he/she has formally opted out of the EvK Trial"